Clinical trial exclusion criterion:
Concomitant use of CYP3A4 or p-glycoprotein inducers or inhibitors

Annotated entities:
- Drug: "CYP3A4"
- Drug: "p-glycoprotein inducers"
- Drug: "p-glycoprotein inhibitors"
- Temporal: "Concomitant"